Clinical trial exclusion criterion:
Recent (2-year) history or evidence of alcoholism or drug abuse

Annotated entities:
- Condition: "alcoholism"
- Condition: "drug abuse"
- Temporal: "history"
- Mood: "evidence"
- Temporal: "Recent"
- Temporal: "2-year"